Cuando en un informe de laboratorio observamos que el/la paciente presenta un aumento de la concentración de transferrina con disminución de su saturación, podemos pensar en:
1. Anemia perniciosa.
2. Anemia drepanocítica.
3. Talasemia mayor.
4. Esferocitosis hereditaria.
5. Anemia por déficit de hierro.

Respuesta correcta: 5. Anemia por déficit de hierro.